Clinical trial inclusion criterion:
scheduled for elective CD under spinal anesthesia

Annotated entities:
- Mood: "scheduled for"
- Qualifier: "elective"
- Procedure: "CD"
- Procedure: "spinal anesthesia"